Clinical trial exclusion criteria:
A medical condition that could interfere with study participation
Body weight less than 50 kg
Participating in another study involving an investigational medication

Annotated entities:
- Non-query-able: "A medical condition that could interfere with study participation"
- Measurement: "Body weight"
- Value: "less than 50 kg"
- Competing_trial: "Participating in another study involving an investigational medication"